Dependence upon opioids

The above is a clinical trial exclusion criterion. Annotated with entity spans:
[Condition: Dependence upon opioids]